Pulmonary disease

The above is a clinical trial inclusion criterion. Annotated with entity spans:
[Condition: Pulmonary disease]